下列何種白血球對不表現 MHC class I 的腫瘤細胞具抑制的效果？
A. CD4 T cells
B. NK cells
C. Plasma cells
D. CD8 T cells

正確答案：B. NK cells